Clinical trial inclusion criterion:
Males or females above the age of 18

Annotated entities:
- Person: "Males"
- Person: "females"
- Value: "above the age of 18"
- Person: "age"